下列那一種 neurotransmitter 是屬於抑制性（inhibitory）的？
A. glutamate
B. substance P
C. γ-aminobutyric acid（GABA）
D. aspartate

正確答案：C. γ-aminobutyric acid（GABA）